What is the percentage of responders to tetrabenazine treatment for dystonia in children?

Tetrabenazine is used empirically in the treatment of dystonia in children with variable success. Observational studies report improvement of up to > 60% of the patients.